La hormona que facilita la reabsorción de agua por parte de los riñones, cuya ausencia provoca pérdida de grandes cantidades da agua por la orina, se denomina:
1. Oxitocina.
2. Vasopresina.
3. Dopamina.
4. Colecistoquinina.
5. Glutamato.

Respuesta correcta: 2. Vasopresina.